下列對於精液及精子專有名詞的解釋，何者錯誤？
A. necrozoospermia：所有的精蟲都沒有活動力
B. asthenozoospermia：精蟲活動力過盛
C. oligozoospermia：精蟲數量少
D. azoospermia：精液中無精蟲

正確答案：B. asthenozoospermia：精蟲活動力過盛